En el informe de salud de la Sra. P. T. de 83 años de edad, se recoge que presenta un cuadro depresivo. Respecto a la depresión en las personas mayores se ha descrito que:
1. Es infrecuente que presenten síntomas somáticos.
2. No es característico que aparezcan trastornos cognitivos.
3. La escala de Yesavage es un instrumento para establecer un diagnóstico seguro de depresión.
4. Existe unanimidad al afirmar que tiene unas manifestaciones específicas en mayores.
5. Puede haber cuadros de seudodemencia, con síntomas de demencia pero originados por estados depresivos.

Respuesta correcta: 5. Puede haber cuadros de seudodemencia, con síntomas de demencia pero originados por estados depresivos.